下列關於第二型糖尿病治療之敘述，何者錯誤？
A. 一般以糖化血紅素（hemoglobin A1c）小於7%為目標
B. 口服降血糖藥物以磺氨尿素類（sulfonylurea）製劑為第一線用藥
C. DPP-4抑制劑之功能是提高餐後血中GLP-1之濃度
D. α-glucosidase抑制劑主要用於降低餐後血糖

正確答案：B. 口服降血糖藥物以磺氨尿素類（sulfonylurea）製劑為第一線用藥